Clinical trial exclusion criterion:
Body mass index (BMI)range 20-50 (excluding all women with BMI under 20 or over 50).

Entity relations:
- Has_value("Body mass index (BMI)", "range 20-50")